Subject is currently involved in another investigational study.

The above is a clinical trial exclusion criterion. Annotated with entity spans:
[Competing_trial: Subject is currently involved in another investigational study.]